Clinical trial exclusion criterion:
women who are pregnant, lactating, or planning on becoming pregnant

Annotated entities:
- Person: "women"
- Condition: "pregnant"
- Condition: "lactating"
- Mood: "planning on becoming"
- Condition: "pregnant"